關於喉頭罩氣道（Laryngeal mask airway），下列敘述何者錯誤？
A. 心臟停止跳動時，一定要氣管插管，絕不可以使用喉頭罩氣道
B. 氣管插管（Endotracheal intubation）失敗且使用 Bag-valve-mask device 無法通氣時，可以使用喉頭罩氣道通氣
C. 使用喉頭罩氣道通氣比 Face mask 更緊密可靠
D. 喉頭罩氣道可使用於 C-spine injury 的病人

正確答案：A. 心臟停止跳動時，一定要氣管插管，絕不可以使用喉頭罩氣道